Clinical trial exclusion criterion:
Previous vaginal delivery.

Annotated entities:
- Procedure: "vaginal delivery"
- Temporal: "Previous"